下列何者不是人類免疫缺乏病毒（HIV）的傳染途徑？
A. 日常生活接觸
B. 輸血
C. 紋身
D. 哺乳

正確答案：A. 日常生活接觸